El ácido dipicolínico es:
1. Uno de los primeros antibióticos del grupo de las quinolonas.
2. Un compuesto característico de las endosporas bacterianas.
3. Un compuesto de reserva presente en los corpúsculos metacromáticos.
4. Un polisacárido ácido presente en la pared de los Gram positivos.
5. Uno de los aminoácidos del peptidoglicano de Gram negativos.

Respuesta correcta: 2. Un compuesto característico de las endosporas bacterianas.